Clinical trial exclusion criteria:
Fasting plasma glucose > 7,0 mM, HbA1c > 48 mmol/mol 3 months after RYGB
Dysregulated thyroid diseases, use of antithyroid treatment.
Late diabetic complications as retinopathy, renal insufficiency, neuropathy or previous pancreatitis.
Complications to RYGB. Documented reactive hypoglycaemia, severe dumping (vomiting, diarrhea, severe abdominal pain after food intake)
Cholecystectomy.

Annotated entities:
- Measurement: "Fasting plasma glucose"
- Value: "> 7,0 mM"
- Measurement: "HbA1c"
- Value: "> 48 mmol/mol"
- Temporal: "3 months after RYGB"
- Qualifier: "Dysregulated"
- Condition: "thyroid diseases"
- Procedure: "antithyroid treatment"
- Condition: "Late diabetic complications"
- Condition: "retinopathy"
- Condition: "renal insufficiency"
- Condition: "neuropathy"
- Temporal: "previous"
- Condition: "pancreatitis"
- Condition: "Complications"
- Procedure: "RYGB"
- Condition: "reactive hypoglycaemia"
- Qualifier: "severe"
- Condition: "dumping"
- Condition: "vomiting"
- Condition: "diarrhea"
- Qualifier: "severe"
- Condition: "abdominal pain"
- Temporal: "after food intake"
- Reference_point: "food intake"
- Procedure: "Cholecystectomy"